Estimated fetal weight greater than 4500 grams in diabetic and 5000 grams in non-diabetic mother

The above is a clinical trial exclusion criterion. Annotated with entity spans:
[Measurement: Estimated fetal weight] [Value: greater than 4500 grams] in [Condition: diabetic] and [Value: 5000 grams] in [Negation: non-][Condition: diabetic] mother